3. At least 2 lesions (located in different vessels and in different territories) potentially amenable to stent implantation;

The above is a clinical trial inclusion criterion. Annotated with entity spans:
3. [Value: At least 2] [Condition: lesions] ([Qualifier: located in different vessels] and in different territories) [Observation: potentially amenable] to [Procedure: stent implantation];